Current or ex-smokers with a smoking history of at least 10 pack years (number of pack years = [number of cigarettes per day / 20] x number of years smoked, e.g., 20 cigarettes per day for 10 years, or 10 cigarettes per day for 20 years).

The above is a clinical trial inclusion criterion. Annotated with entity spans:
[Temporal: Current] or [Negation: ex]-[Condition: smokers] with a [Measurement: smoking history] of at least [Value: 10 pack years] (number of pack years = [number of cigarettes per day / 20] x number of years smoked, e.g., 20 cigarettes per day for 10 years, or 10 cigarettes per day for 20 years).